STI (rectal or vaginal gonorrhea or syphilis) diagnosis during the last 6 months.

The above is a clinical trial inclusion criterion. Annotated with entity spans:
[Condition: STI] ([Condition: rectal] or [Condition: vaginal gonorrhea] or [Condition: syphilis]) diagnosis [Temporal: during the last 6 months].